Which are the typical symptoms of Ménière's disease?

The typical symptoms of Ménière's disease are:
1) sensorineural hearing loss, 
2) vertigo and 
3) tinnitus.